Clinical trial exclusion criterion:
History of hypersensitivity/intolerance to any components of the study inhalers (example, lactose, magnesium stearate). In addition, subjects with a history of severe milk protein allergy that, in the opinion of the study physician, contraindicates participation will also be excluded.

Annotated entities:
- Condition: "hypersensitivity"
- Condition: "intolerance"
- Drug: "lactose"
- Drug: "magnesium stearate"
- Drug: "components of the study inhalers"
- Temporal: "history"
- Qualifier: "severe"
- Drug: "milk protein"
- Condition: "allergy"
- Non-query-able: "in the opinion of the study physician"
- Condition: "contraindicates participation"